Clinical trial exclusion criterion:
Any of gangrene, osteomyelitis, cellulitis, or Charcot osteoarthropathy.

Entity relations:
- Has_multiplier("gangrene", "Any of")
- OR("gangrene", "cellulitis", "osteomyelitis", "Charcot osteoarthropathy")